一位 18 歲男性病人被不明化學液體噴濺到眼部，揉了眼睛後，感到劇烈刺痛且視力受損，遂至急診就診。下列敘述何者較不恰當？
A. 不論鹼性或酸性化學物質，處理的原則是類似的
B. 一般而言，酸性化學物質造成的傷害比鹼灼傷較為嚴重
C. 在以生理食鹽水沖洗 20～30 分鐘後，可以測量眼液的酸鹼度，如果 pH > 7.4，仍需繼續沖洗
D. 若有表淺性角膜傷害，可以用局部麻醉劑來減少疼痛

正確答案：B. 一般而言，酸性化學物質造成的傷害比鹼灼傷較為嚴重